Presence of at least 2 ischemic digital cutaneous ulcerations on two different fingers, with digital ulcers classified as "active ulcers" according to the North American working group definition: epithelial denudation is clearly Visible at one place and the bed of de-epithelialized ulcer can be seen; Ulcerations distal to the proximal interphalangeal joint, not associated with calcinosis or bony relief.

The above is a clinical trial inclusion criterion. Annotated with entity spans:
Presence of [Multiplier: at least 2] [Condition: ischemic digital cutaneous ulcerations] on two different fingers, with [Condition: digital ulcers] classified as "[Qualifier: active] ulcers" according to the [Measurement: North American working group definition]: [Qualifier: epithelial denudation is clearly Visible at one place and the bed of de-epithelialized ulcer can be seen; Ulcerations distal to the proximal interphalangeal joint, not associated with calcinosis or bony relief].